有關 rectocele 之敘述，下列何者錯誤？
A. 通常發生在遠側直腸至肛門管的括約肌近側之間
B. 常不只是單一的病因所引起
C. 都會有症狀，所以一定要手術治療
D. 手術治療除了經直腸進行之外，也可經陰道進行

正確答案：C. 都會有症狀，所以一定要手術治療